Which calcium channels does ethosuximide target?

Ethosuximide blocks the T-type calcium channels.